Clinical trial exclusion criterion:
heavy smokers (with a daily consumption >20 cigarettes)

Entity relations:
- Has_qualifier("smokers", "heavy")
- Has_multiplier("cigarettes", "daily consumption >20")